Clinical trial exclusion criterion:
Has been previously treated with sugammadex or has participated in a sugammadex clinical trial.

Annotated entities:
- Drug: "sugammadex"
- Temporal: "previously"
- Observation: "participated in clinical trial"
- Drug: "sugammadex"